二尖瓣狹窄病人較罕見的胸部 X 光變化是：
A. 左心房擴大
B. 左心耳擴大
C. 左心室擴大
D. 右心室擴大

正確答案：C. 左心室擴大